¿Qué elemento juega un papel fisiológico en la prevención del reflujo gastroesofágico?
1. Esfínter esofágico superior.
2. Ángulo de His.
3. Hernia de Hiato.
4. Ángulo de Purkinje.
5. Esfínter pilórico.

Respuesta correcta: 2. Ángulo de His.